C. S. que está embarazada de 40 semanas y contrae la rubeola, consulta con la enfermera sus dudas sobre si podrá dar lactancia materna al recién nacido. ¿Cuál será la respuesta de la enfermera?:
1. Está totalmente contraindicada.
2. Es compatible la enfermedad y también la vacunación con la lactancia.
3. Debe esperar hasta que el bebé tenga 15 días de vida.
4. Depende de la carga viral.
5. Se iniciará la lactancia materna 3 días después de poner la gammaglobulina al bebé.

Respuesta correcta: 2. Es compatible la enfermedad y también la vacunación con la lactancia.